12. Current use of fibrates, including fenofibrates, or simvastatin

The above is a clinical trial exclusion criterion. Annotated with entity spans:
[Parsing_Error: 12.] [Temporal: Current] use of [Drug: fibrates], including [Drug: fenofibrates], or [Drug: simvastatin]